在黑暗中，有關視網膜錐形細胞的敘述，下列何者錯誤？
A. Guanosine monophosphate（GMP）濃度上升
B. Influx of calcium
C. 細胞處於去極化狀態（depolarized state）
D. Outer segment 膜上的鈣離子通道處於開啟狀態

正確答案：A. Guanosine monophosphate（GMP）濃度上升